Clinical trial exclusion criterion:
Women of child-bearing potential, defined as all women physiologically capable of becoming pregnant, unless they are using highly effective methods of contraception during the study and for 30 days after the final dose of nilotinib.

Annotated entities:
- Person: "Women"
- Observation: "child-bearing potential"
- Observation: "physiologically capable of becoming pregnant"
- Person: "women"
- Negation: "unless"
- Qualifier: "highly effective methods"
- Observation: "contraception"
- Temporal: "during the study"
- Temporal: "for 30 days after the final dose of nilotinib"
- Reference_point: "the final dose of nilotinib"